下列有關中樞神經系統（CNS）的神經膠細胞（neuroglia）的敘述，何者正確？
A. 寡突膠細胞（oligodendrocyte）類似周邊神經系統（PNS）的許旺細胞（Schwann cell），負責形成髓鞘
B. 星狀膠細胞（astrocyte）是立方形細胞，分布在脊髓中央管（central canal）和腦室的特化上皮
C. 微小膠細胞（microglia）是在灰質中數目最多的細胞，其分支可與血管接觸
D. 室管膜細胞（ependymal cell）有許多分支，負責吞噬與參與免疫功能

正確答案：A. 寡突膠細胞（oligodendrocyte）類似周邊神經系統（PNS）的許旺細胞（Schwann cell），負責形成髓鞘